Clinical trial exclusion criterion:
contraindication for combined antiplatelet treatment

Annotated entities:
- Condition: "contraindication"
- Procedure: "combined antiplatelet treatment"